Cuando la persona tiene un extraño sentimiento de irrealidad con respecto a sí mismo, aunque sabe que nada ha cambiado, se dice que padece:
1. Difusión del ego.
2. Autoscopia.
3. Ausencia personal.
4. Despersonalización.

Respuesta correcta: 4. Despersonalización.